林小妹罹患血癌，因長時間以傳統癌症治療藥物治療後，免疫力降低，為避免口腔內念珠菌之伺機性感染，常用下列何種藥物來預防？
A. Griseofulvin
B. Miconazole
C. Terbinafine
D. Nystatin

正確答案：D. Nystatin